¿Cuál de los siguientes signos clínicos NO se observa en las lesiones de la neurona motora inferior?
1. Parálisis.
2. Amiotrofia.
3. Fasciculaciones.
4. Arreflexia.
5. Hipoestesia.

Respuesta correcta: 5. Hipoestesia.